有位60歲停經的婦人，到醫院做腰椎、股骨、頸骨和髖骨的骨質密度檢查，結果發現這些骨骼都有低骨密度的現象。下列何者最可能因慢性使用，而導致婦人的骨質疏鬆症？
A. lovastatin
B. metformin
C. propranolol
D. prednisone

正確答案：D. prednisone